下列何者沒有通過肘窩（cubital fossa）？
A. 肱動脈（brachial artery）
B. 肱二頭肌肌腱（tendon of biceps brachii）
C. 正中神經（median nerve）
D. 尺神經（ulnar nerve）

正確答案：D. 尺神經（ulnar nerve）